Clinical trial exclusion criterion:
Presence of relative or absolute contraindications to CPFA

Annotated entities:
- Condition: "relative contraindications"
- Condition: "absolute contraindications"
- Procedure: "CPFA"